Clinical trial inclusion criterion:
antidiabetic treatment with either diet, metformin, DPP4, GLP1, pioglitazone, acarbose, or respective combinations

Annotated entities:
- Procedure: "antidiabetic treatment"
- Observation: "diet"
- Drug: "metformin"
- Drug: "DPP4"
- Drug: "GLP1"
- Drug: "pioglitazone"
- Drug: "acarbose"